Clinical trial exclusion criterion:
Planned administration of a vaccine not foreseen by the study protocol up to 30 days after the second vaccination with H5N1 vaccine.

Annotated entities:
- Drug: "vaccine"
- Qualifier: "foreseen by the study protocol"
- Negation: "not"
- Temporal: "up to 30 days"
- Drug: "vaccination"
- Value: "second"
- Drug: "H5N1 vaccine"